Clinical trial inclusion criterion:
Patients that have elected to have a nerve block

Annotated entities:
- Procedure: "nerve block"
- Mood: "elected to have"